¿Cuál de las siguientes características farmacocinéticas de los antibióticos aminoglucósidos no es correcta:
1. No se absorben prácticamente en el tracto gastrointestinal de pacientes normales.
2. Se absorben en pacientes con insuficiencia renal grave.
3. Presentan una fase de distribución muy lenta.
4. No se metabolizan.
5. Presentan una segunda fase de eliminación muy lenta.

Respuesta correcta: 3. Presentan una fase de distribución muy lenta.